Histologically confirmed locally advanced gastric (primary endpoint includes proximal and mid-body stomach) or esophagogastric adenocarcinoma; distal gastric (antral) adenocarcinomas are eligible for enrolment but will not be included in the primary analysis

The above is a clinical trial inclusion criterion. Annotated with entity spans:
Histologically confirmed [Qualifier: locally advanced] gastric (primary endpoint includes [Qualifier: proximal] and [Qualifier: mid-body stomach]) or [Condition: esophagogastric adenocarcinoma]; [Qualifier: distal gastric] ([Qualifier: antral]) [Condition: adenocarcinomas] [Non-query-able: are eligible for enrolment but will not be included in the primary analysis]